Clinical trial exclusion criterion:
medications changing notably paracetamol (acetaminophen) and/or ropivacaine metabolism in regular use

Annotated entities:
- Drug: "paracetamol"
- Drug: "acetaminophen"
- Drug: "ropivacaine"
- Multiplier: "regular use"